有關輸尿管結石之敘述，下列何者錯誤？
A. 大於 7 mm 的輸尿管結石自行排出的機率較低，建議接受體外震波碎石術或輸尿管內視鏡取石術治療
B. 使用甲型交感神經阻斷劑（alpha-adrenergic blocker），並不會增加輸尿管結石的排出率
C. 輸尿管結石合併腎水腫及腎盂蓄膿（pyonephrosis），引發敗血症時，應在手術碎石前，先採取經皮腎造瘻術（percutaneous nephrostomy），引流腎盂內受感染的尿液
D. 輸尿管結石的自行排出率，與結石在輸尿管中的位置有很大的關係

正確答案：B. 使用甲型交感神經阻斷劑（alpha-adrenergic blocker），並不會增加輸尿管結石的排出率